La terapia basada en la mentalización se centra en:
1. El fomento de la flexibilización del patrón de funcionamiento desadaptativo.
2. Las interpretaciones transferenciales que emergen en la relación entre paciente y terapeuta.
3. La promoción de la motivación para relacionarse con los otros significativos y establecer límites seguros.
4. La regulación de las emociones.
5. La capacidad para adquirir un sentido de sí mismo y de los otros en términos de estados subjetivos y procesos mentales.

Respuesta correcta: 5. La capacidad para adquirir un sentido de sí mismo y de los otros en términos de estados subjetivos y procesos mentales.